What is  Achondroplasia?

Achondrogenesis type II also known as  Achondroplasia  is an autosomal-dominant disease leading to severe micromelic dwarfism